Clinical trial exclusion criterion:
Intake of any chronic opioids or pain medications preoperatively

Annotated entities:
- Multiplier: "chronic"
- Drug: "opioids"
- Qualifier: "any"
- Drug: "pain medications"
- Temporal: "preoperatively"